下列那一段腎血管可作為逆流交換器（counter-current exchanger），以維持腎臟內之滲透壓差？
A. 入球小動脈（afferent arteriole）
B. 腎絲球（glomerulus）
C. 出球小動脈（efferent arteriole）
D. 直血管（vasa recta）

正確答案：D. 直血管（vasa recta）